Clinical trial exclusion criterion:
Newborns with infection of the umbilical cord at birth

Annotated entities:
- Person: "Newborns"
- Condition: "infection of the umbilical cord"
- Temporal: "at birth"